Clinical trial inclusion criterion:
Measurable disease

Annotated entities:
- Condition: "Measurable disease"